orthodontic appliance

The above is a clinical trial exclusion criterion. Annotated with entity spans:
[Device: orthodontic appliance]